關於癲癇（epilepsy）的敘述，下列何者正確？
A. 當發作純粹為déjà vu 或 jamais vu時，歸類於complex partial seizure
B. 在complex partial seizure發作時，病人神智清醒
C. 在reflex epilepsies中，以聲音誘發之發作（auditory-induced seizure）最為常見
D. 70%至80%之complex partial seizure起源自大腦顳葉

正確答案：D. 70%至80%之complex partial seizure起源自大腦顳葉